一分子的丙酮酸（pyruvate）經由丙酮酸脫氫（pyruvate dehydrogenase）以及檸檬酸循環（citric acid cycle）代謝生成 3 分子二氧化碳時，可以產生 1 分子的 FADH2，1 分子的 ATP（或 GTP），以及幾分子的 NADH？
A. 1
B. 2
C. 3
D. 4

正確答案：D. 4